Have measurable or evaluated disease based on RECIST 1.1 as determined by investigator.

The above is a clinical trial inclusion criterion. Annotated with entity spans:
[Non-query-able: Have measurable or evaluated disease based on RECIST 1.1 as determined by investigator].